Subject has any history of successful or unsuccessful treatment of AF with class I or III antiarrhythmic or sotalol with the intention to prevent an AF recurrence. Patients pretreated with above AAD at maximum 48 hours with the intention to convert an AF episode are allowed.

The above is a clinical trial exclusion criterion. Annotated with entity spans:
Subject has any history of successful or unsuccessful treatment of [Condition: AF] with [Qualifier: class I] or III [Drug: antiarrhythmic] or [Drug: sotalol] [Non-query-able: with the intention to prevent an AF recurrence. Patients pretreated with above AAD at maximum 48 hours with the intention to convert an AF episode are allowed].